Clinical trial exclusion criterion:
Known history of hypersensitivity reaction or intolerability to Ace Inh or ARB.

Entity relations:
- AND("hypersensitivity reaction", "Ace Inh")
- Has_temporal("hypersensitivity reaction", "history")
- OR("Ace Inh", "ARB")
- OR("hypersensitivity reaction", "intolerability")